En una mujer de 29 años se hallan en el curso de una analítica de rutina los siguientes parámetros: Hb 11,5 g/dL, VCM 70 fl, HCM 28 pg, Ferritina 10 ng/mL, leucocitos 5.200/mm3, plaquetas 335.000/mm3. La exploración física es normal. La exploración más indicada en esta situación es:
1. Exploración ginecológica.
2. Estudio de sangre oculta en heces.
3. Estudio radiológico de aparato digestivo.
4. Electroforesis de hemoglobinas.
5. Test de Coombs.

Respuesta correcta: 1. Exploración ginecológica.